輸血引起之急性 C 型肝炎病人，急性期末經特殊藥物治療，出院 6 個月後返院回診，無明顯肝炎症狀，ALT 正常，但 anti-HCV（+），此時表示病人之 C 型肝炎：
A. 已有免疫力，不具傳染性
B. 可能仍具傳染性
C. 仍須積極治療 3 個月
D. 仍須積極治療 6 個月

正確答案：B. 可能仍具傳染性